Use of medications that alter the absorption or metabolism of levothyroxine

The above is a clinical trial exclusion criterion. Annotated with entity spans:
Use of [Drug: medications] that [Negation: alter] the [Observation: absorption] or [Observation: metabolism of levothyroxine]